有關胎盤障蔽（placental barrier）的敘述，下列何者正確？
A. 在懷孕第四個月開始時，胎盤障蔽開始逐漸變厚
B. 胎盤障蔽的絨毛壁逐漸變薄，是由於合體滋養層（syncytiotrophoblast）退化所致
C. 胎盤障蔽與肺之血空氣障蔽在組織結構與功能上極為相似
D. 胎盤障蔽在最薄的部分，含有一層連續而完整的細胞滋養層（cytotrophoblast）

正確答案：C. 胎盤障蔽與肺之血空氣障蔽在組織結構與功能上極為相似